Clinical trial exclusion criterion:
With a history of mental illness and/or family history of mental illness;

Entity relations:
- Has_context("mental illness", "family history")
- Has_temporal("mental illness", "history")
- OR("mental illness", "mental illness")